Clinical trial exclusion criterion:
Newborns with any contraindications to routine circumcision, anatomical or hematologic.

Entity relations:
- AND("contraindications", "circumcision")